Clinical trial exclusion criteria:
Severe Hypertension Grade 3 WHO classification (Mean Sitting Diastolic Blood Pressure (MSDBP) 110 mmHg and/or Mean Sitting Systolic Blood Pressure MSSBP 180 mmHg)
Acetylsalicyclic acid (ASA) treatment >1g/day or regular use of Non steroidal anti-inflammatory drug (NSAIDs)
Kidney disease not caused by diabetes or hypertension
Serum potassium < 3.5 or > 5.1 mEq/L
GFR < 40 ml/min/1.73m2 as measured by the MDRD formula
Serum albumin < 2.0mg/dL
History of hypertensive encephalopathy or cerebrovascular accident at any time prior to Visit1.
Current diagnosis of heart failure (New York Heart Association (NYHA) Class II-IV)
History of myocardial infarction, unstable angina pectoris, coronary bypass surgery, or any percutaneous coronary intervention (PCI) during the 6 months prior to Visit 1
Second or third degree heart block without a pacemaker
Concurrent potentially life threatening arrhythmia or symptomatic arrhythmia
Clinically significant valvular heart disease
Type 1 diabetes mellitus
Uncontrolled Type II diabetes mellitus (Hemaglobin subtype A1C (HbA1C) >11 %)
History of malignancy including leukemia and lymphoma (but not basal cell skin carcinoma) within the past five years
Participation in any clinical investigation within 4 weeks prior to dosing or longer if required by local regulation.
Donation or loss of 400 mL or more of blood within 8 weeks prior to dosing.
Significant illness within the two weeks prior to dosing.
Any surgical or medical condition which might significantly alter the absorption, distribution, metabolism, or excretion of study drugs including, but not limited to, any of the following:
History of major gastrointestinal tract surgery such as gastrectomy, gastroenterostomy, or bowel resection
-Currently active or previously active inflammatory bowel disease during the 12 months prior to Visit 1 Currently active gastritis, duodenal or gastric ulcers, or gastrointestinal/rectal bleeding during the 3 months prior to Visit 1.
Any history of pancreatic injury, pancreatitis or evidence of impaired pancreatic function/injury as indicated by abnormal lipase or amylase Evidence of hepatic disease, a history of hepatic encephalopathy, a history of esophageal varices, or a history of portocaval shunt
Current treatment with cholestyramine or cholestipol resins
History of immunocompromise, including a positive HIV test result.
History of a positive Hepatitis B surface antigen (HBsAg) or Hepatitis C test result.
History of drug or alcohol abuse within the 12 months prior to dosing.
Persons directly involved in the execution of this protocol.
Any condition that in the opinion of the investigator or the Novartis medical monitor would jeopardize the evaluation of efficacy or safety
History of noncompliance to medical regimens or unwillingness to comply with the study protocol
Known or suspected contraindications to the study medications, including history of allergy to Angiotensin converting enzyme (ACE) inhibitors and/or to thiazide diuretics or other sulfonamide derived drug
Any surgical or medical condition, which in the opinion of the investigator, may place the patient at higher risk from his/her participation in the study, or is likely to prevent the patient from complying with the requirements of the study or completing the study
Use of any prescription drug or over-the-counter (OTC) medication which is prohibited by the protocol.
Patients who previously participated in any Aliskiren study.
Pregnant or nursing woman.
Other protocol-defined inclusion/exclusion criteria may apply

Annotated entities:
- Condition: "Severe Hypertension"
- Measurement: "Grade WHO classification"
- Value: "3"
- Measurement: "Mean Sitting Diastolic Blood Pressure (MSDBP)"
- Value: "110 mmHg"
- Measurement: "Mean Sitting Systolic Blood Pressure MSSBP"
- Value: "180 mmHg"
- Procedure: "Acetylsalicyclic acid (ASA) treatment"
- Value: ">1g/day"
- Drug: "Non steroidal anti-inflammatory drug (NSAIDs)"
- Condition: "Kidney disease"
- Condition: "diabetes"
- Condition: "hypertension"
- Measurement: "Serum potassium"
- Value: "< 3.5"
- Value: "> 5.1 mEq/L"
- Measurement: "GFR"
- Value: "< 40 ml/min/1.73m2"
- Qualifier: "MDRD formula"
- Measurement: "Serum albumin"
- Value: "< 2.0mg/dL"
- Condition: "hypertensive encephalopathy"
- Condition: "cerebrovascular accident"
- Temporal: "History"
- Temporal: "any time prior"
- Condition: "heart failure"
- Measurement: "New York Heart Association (NYHA) Class"
- Value: "II-IV"
- Condition: "myocardial infarction"
- Condition: "unstable angina pectoris"
- Condition: "coronary bypass surgery"
- Condition: "percutaneous coronary intervention (PCI)"
- Temporal: "during the 6 months prior"
- Temporal: "History"
- Condition: "third degree heart block"
- Condition: "Second degree heart block"
- Device: "pacemaker"
- Negation: "without"
- Condition: "arrhythmia"
- Qualifier: "potentially life threatening"
- Condition: "arrhythmia"
- Qualifier: "symptomatic"
- Condition: "valvular heart disease"
- Condition: "Type 1 diabetes mellitus"
- Condition: "Type II diabetes mellitus"
- Measurement: "Hemaglobin subtype A1C (HbA1C)"
- Value: ">11 %"
- Qualifier: "Uncontrolled"
- Condition: "malignancy"
- Condition: "leukemia"
- Condition: "lymphoma"
- Condition: "basal cell skin carcinoma"
- Temporal: "within the past five years"
- Temporal: "within 4 weeks prior to dosing"
- Competing_trial: "any clinical investigation"
- Reference_point: "dosing"
- Value: "400 mL or more"
- Temporal: "within 8 weeks prior"
- Procedure: "Donation of blood"
- Condition: "loss of blood"
- Condition: "Significant illness"
- Temporal: "within the two weeks prior"
- Condition: "surgical condition"
- Condition: "medical condition"
- Qualifier: "alter the absorption, distribution, metabolism, or excretion of study drugs"
- Temporal: "History"
- Condition: "major gastrointestinal tract surgery"
- Procedure: "gastrectomy"
- Procedure: "gastroenterostomy"
- Procedure: "bowel resection"
- Condition: "inflammatory bowel disease"
- Temporal: "during the 12 months prior"
- Temporal: "Currently active"
- Temporal: "Currently active"
- Temporal: "previously active"
- Condition: "gastritis"
- Condition: "duodenal"
- Condition: "gastric ulcers"
- Condition: "gastrointestinal bleeding"
- Condition: "rectal bleeding"
- Temporal: "during the 3 months prior"
- Condition: "pancreatic injury"
- Temporal: "history"
- Condition: "pancreatitis"
- Measurement: "pancreatic function"
- Value: "impaired"
- Condition: "pancreatic injury"
- Measurement: "lipase"
- Value: "abnormal"
- Measurement: "amylase"
- Condition: "hepatic disease"
- Temporal: "history"
- Condition: "hepatic encephalopathy"
- Condition: "esophageal varices"
- Condition: "portocaval shunt"
- Temporal: "history"
- Temporal: "history"
- Drug: "cholestyramine"
- Drug: "cholestipol resins"
- Temporal: "Current"
- Condition: "immunocompromise"
- Temporal: "History"
- Measurement: "HIV test"
- Value: "positive"
- Temporal: "History"
- Measurement: "Hepatitis B surface antigen (HBsAg) test"
- Measurement: "Hepatitis C test"
- Value: "positive"
- Temporal: "History"
- Condition: "drug abuse"
- Condition: "alcohol abuse"
- Temporal: "within the 12 months prior"
- Non-query-able: "Persons directly involved in the execution of this protocol."
- Condition: "condition"
- Non-representable: "in the opinion of the investigator"
- Non-representable: "in the opinion of the Novartis medical monitor"
- Qualifier: "that would jeopardize the evaluation of efficacy"
- Qualifier: "that would jeopardize safety"
- Temporal: "History of"
- Observation: "noncompliance to medical regimens"
- Mood: "unwillingness to"
- Informed_consent: "comply with the study protocol"
- Condition: "allergy"
- Drug: "Angiotensin converting enzyme (ACE) inhibitors"
- Drug: "thiazide diuretics"
- Drug: "sulfonamide derived drug"
- Condition: "contraindications"
- Drug: "study medications"
- Temporal: "history of"
- Qualifier: "other"
- Condition: "medical condition"
- Condition: "surgical condition"
- Non-query-able: "in the opinion of the investigator"
- Qualifier: "place the patient at higher risk from his/her participation in the study"
- Mood: "likely to prevent the patient from"
- Informed_consent: "complying with the requirements of the study"
- Negation: "prevent"
- Drug: "prescription drug"
- Drug: "over-the-counter (OTC) medication"
- Qualifier: "prohibited by the protocol"
- Drug: "Aliskiren"
- Temporal: "previously"
- Competing_trial: "Aliskiren study"
- Condition: "Pregnant"
- Condition: "nursing"
- Person: "woman"
- Qualifier: "Other"
- Qualifier: "protocol-defined"
- Non-representable: "Other protocol-defined inclusion/exclusion criteria may apply"